30歲孕婦，妊娠42週，欲予引產，根據Bishop score評分其子宮頸成熟度，若子宮頸閉合，Effacement 10%，Station：-3，子宮頸硬度為堅硬（firm），並且子宮頸位於後方。Bishop score為幾分？
A. 0
B. 3
C. 6
D. 9

正確答案：A. 0